5. Severe chronic obstructive pulmonary disease

The above is a clinical trial exclusion criterion. Annotated with entity spans:
[Parsing_Error: 5.] [Qualifier: Severe] [Condition: chronic obstructive pulmonary disease]